Clinical trial exclusion criteria:
Patients with prior fistulotomy, fistulectomy, LIFT, cutting seton or advancement flap procedure
Fistula with multiple tracts
Recto-vaginal fistula
Active infection in the anal fistula
Physical allergies or cultural objections to porcine products
Patient is not medically fit to undergo the LIFT procedure as judged by the treating physician
Previous diagnosis of collagen disorder
History of Crohn's Disease, Irritable Bowel Syndrome, radiation therapy in the rectoanal region

Annotated entities:
- Procedure: "fistulotomy"
- Procedure: "fistulectomy"
- Procedure: "LIFT"
- Procedure: "cutting seton"
- Procedure: "advancement flap procedure"
- Condition: "Fistula"
- Qualifier: "multiple tracts"
- Condition: "Recto-vaginal fistula"
- Condition: "anal fistula"
- Condition: "infection in the anal fistula"
- Non-query-able: "Physical allergies or cultural objections to porcine products"
- Subjective_judgement: "Patient is not medically fit to undergo the LIFT procedure as judged by the treating physician"
- Post-eligibility: "Patient is not medically fit to undergo the LIFT procedure as judged by the treating physician"
- Condition: "collagen disorder"
- Condition: "Crohn's Disease"
- Condition: "Irritable Bowel Syndrome"
- Procedure: "radiation therapy"
- Qualifier: "rectoanal region"
- Temporal: "History"